Clinical trial exclusion criterion:
Researchers believe that the situation is unsuitable for participation in the group

Annotated entities:
- Non-query-able: "Researchers believe that the situation is unsuitable for participation in the grou"